下列何種氣體於體液之擴散係數（diffusion coefficient）最高？
A. Oxygen
B. Nitrogen
C. Carbon monoxide
D. Carbon dioxide

正確答案：D. Carbon dioxide